Brain tumor

The above is a clinical trial exclusion criterion. Annotated with entity spans:
[Condition: Brain tumor]